Clinical trial exclusion criterion:
Use of strong CYP3A4/P-glycoprotein inhibitors (specifically ritonavir, ketoconazole, clarithromycin, cyclosporine, diltiazem and verapamil)

Entity relations:
- Subsumes("strong CYP3A4/P-glycoprotein inhibitors", "ritonavir")
- OR("ritonavir", "ketoconazole", "clarithromycin", "cyclosporine", "diltiazem", "verapamil")